Clinical trial inclusion criterion:
Not diabetic

Entity relations:
- Has_negation("diabetic", "Not")